Clinical trial exclusion criterion:
All patients who were wheelchair bound preoperatively

Annotated entities:
- Qualifier: "preoperatively"
- Observation: "wheelchair bound"